有關硬皮症（scleroderma）的臨床表現，何者有誤？
A. 會出現抗 topoisomerase (Scl 70) 的抗體
B. 雷諾氏現象（Raynaud phenomenon）通常一直到疾病的晚期才出現
C. 在成人出現的比率比兒童期來得高
D. 患者可能會因為肺病或是肺部動脈高壓而死亡

正確答案：B. 雷諾氏現象（Raynaud phenomenon）通常一直到疾病的晚期才出現